未規則產檢的媽媽急產，其新生兒因呼吸窘迫住院，細菌室通知血液培養長革蘭氏陽性球菌，下列何者為最可能造成此新生兒	血症的細菌？
A. Staphylococcus aureus
B. Streptococcus agalactiae
C. Escherichia coli
D. Listeria monocytogenes

正確答案：B. Streptococcus agalactiae